Clinical trial inclusion criterion:
Interested in quitting smoking

Entity relations:
- Has_mood("quitting smoking", "Interested")